El azufre rómbico, la forma más estable del azufre, está constituido por moléculas del tipo:
1. S 2.
2. S 8.
3. S 4.
4. S 6.
5. Sn(n=10-14).

Respuesta correcta: 2. S 8.